Clinical trial exclusion criterion:
Concomitant treatment by leflunomide, cidofovir, sirolimus, Millepertuis (Hypericum Perforatum)

Entity relations:
- Subsumes("Millepertuis", "Hypericum Perforatum")
- Has_temporal("leflunomide", "Concomitant")
- OR("leflunomide", "Millepertuis", "cidofovir", "sirolimus")